Clinical trial exclusion criterion:
a history of non-standard treatment(chemotherapy or surgery)

Annotated entities:
- Procedure: "non-standard treatment"
- Procedure: "chemotherapy"
- Procedure: "surgery"
- Temporal: "history"